Clinical trial exclusion criterion:
currently pregnant, or trying to become pregnant

Annotated entities:
- Temporal: "currently"
- Condition: "pregnant"
- Mood: "trying to become"
- Condition: "pregnant"